Clinical trial exclusion criterion:
contraindications to sildenafil use or CMR imaging;

Entity relations:
- AND("contraindications", "sildenafil")
- OR("sildenafil", "CMR imaging")